Patients receiving therapeutic heparin medication due to chronic coagulation disease / anticoagulation medication (i.e. partial thromboplastin time > 60 sec)

The above is a clinical trial exclusion criterion. Annotated with entity spans:
Patients receiving therapeutic [Drug: heparin] medication due to [Condition: chronic coagulation disease] / [Drug: anticoagulation medication] (i.e. [Measurement: partial thromboplastin time] [Value: > 60 sec])